What genes is implicated in myotonic goats and other  nondystrophic myotonias?

The gene encoding clcn1, mBNl1, gcic-1, scn4a, clc-1 and dmpk are implicated in myotonic goats and other nondystrophic myotonias.